Clinical trial inclusion criterion:
Be capable and willing to provide written informed consent to participate in this study;

Annotated entities:
- Informed_consent: "Be capable and willing to provide written informed consent to participate in this study"